Clinical trial exclusion criterion:
Contraindication to aminophylline

Annotated entities:
- Condition: "Contraindication"
- Drug: "aminophylline"